Clinical trial inclusion criterion:
COPD diagnosed according to GOLD, FEV1 40-80% predicted, SpO2 =92% at 750 m.

Annotated entities:
- Condition: "COPD"
- Measurement: "GOLD"
- Measurement: "FEV1"
- Value: "40-80% predicted"
- Measurement: "SpO2"
- Value: "=92% at 750 m"